Clinical trial inclusion criterion:
Can achieve a distance visual acuity of 20/30 (0.18 logMAR) or better in each eye with the study contact lenses.

Annotated entities:
- Measurement: "distance visual acuity"
- Value: "20/30 or better"
- Value: "0.18 logMAR or better"
- Device: "study contact lenses"